伴行心臟前室間枝（anterior interventricular branch）走在心臟前室間溝的靜脈是：
A. 心前靜脈（anterior cardiac vein）
B. 心大靜脈（great cardiac vein）
C. 心中靜脈（middle cardiac vein）
D. 心小靜脈（small cardiac vein）

正確答案：B. 心大靜脈（great cardiac vein）